HIV+ patients

The above is a clinical trial exclusion criterion. Annotated with entity spans:
[Condition: HIV+] patients